Both partners plan on remaining in Montreal for at least 1 year

The above is a clinical trial inclusion criterion. Annotated with entity spans:
Both partners [Mood: plan on] [Observation: remaining in Montreal] [Multiplier: for at least 1 year]